Pneumothorax in the two weeks prior to Visit 2

The above is a clinical trial exclusion criterion. Annotated with entity spans:
[Condition: Pneumothorax] [Temporal: in the two weeks prior to Visit 2]